Diagnosed or treated for another malignancy within 2 years before study enrollment or previously diagnosed with another malignancy and have any evidence of residual disease. Participants with non-melanoma skin cancer or carcinoma in situ of any type are not excluded if they have undergone complete resection.

The above is a clinical trial exclusion criterion. Annotated with entity spans:
Diagnosed or treated for another [Condition: malignancy] [Temporal: within 2 years before study enrollment] or [Temporal: previously] diagnosed with [Qualifier: another] [Condition: malignancy] and have [Mood: any evidence of] [Condition: residual disease]. Participants with [Condition: non-melanoma skin cancer] or [Condition: carcinoma in situ] of [Qualifier: any type] are [Negation: not excluded] if they have undergone [Procedure: complete resection].